El área que actúa como conexión entre las respuestas emocionales automáticas y el control de las conductas complejas, guiando la conducta para controlar la manifestación de las respuestas emocionales, es:
1. La circunvolución angular del sistema límbico.
2. La circunvolución o lóbulo de la ínsula.
3. La corteza prefrontal orbitofrontal o ventromedial.
4. El tálamo.
5. La corteza de asociación somatosensorial.

Respuesta correcta: 3. La corteza prefrontal orbitofrontal o ventromedial.